Clinical trial exclusion criterion:
Are pregnant.

Annotated entities:
- Condition: "pregnant"